評估一位失智症（dementia）患者時，作腦部電腦斷層（CT）或磁振造影（MRI）檢查之目的在於：
A. 確定是否有腦萎縮
B. 決定腦萎縮之程度
C. 作為大腦退化程度之年度追蹤指標
D. 找出是否有其他造成失智症之病變如腫瘤、硬腦膜下腔出血等

正確答案：D. 找出是否有其他造成失智症之病變如腫瘤、硬腦膜下腔出血等